下列何者為急性淋巴性白血病（ALL）最不好的預後因子？
A. 染色體數過多（hyperdiploidy）
B. 病發時年紀介於2歲至9歲之間
C. 有費城染色體（Philadelphia chromosome）
D. minimal residual disease（MRD）在induction後已不存在

正確答案：C. 有費城染色體（Philadelphia chromosome）